Clinical trial inclusion criterion:
Midsubstance pain in the achilles tendon

Entity relations:
- Has_qualifier("Midsubstance pain", "achilles tendon")